關於喉癌（laryngeal cancer）之敘述，何者錯誤？
A. 聲門癌（glottic cancer）初期的症狀以聲音沙啞（hoarseness）為主
B. 聲門上癌（supraglottic cancer）初期症狀不明顯，有聲音沙啞時已是較為晚期
C. 聲門下癌（subglottic cancer）初期就會造成呼吸道阻塞
D. 當聲帶運動受腫瘤影響時臨床分期至少為 T3

正確答案：C. 聲門下癌（subglottic cancer）初期就會造成呼吸道阻塞